What monoclonal antibody drugs are used to treat late stage melanoma?

Dabrafenib, ipilimumab and vemurafenib are monoclonal antibodies used to treat late-stage melanoma.